Clinical trial exclusion criterion:
Currently enrolled in, or discontinued within the last 30 days from, a clinical trial involving an off-label use of an investigational drug.

Annotated entities:
- Competing_trial: "Currently enrolled in, or discontinued within the last 30 days from, a clinical trial involving an off-label use of an investigational drug."